Females of childbearing potential who are pregnant, breast-feeding or intend to become pregnant or are not using adequate contraceptive methods

The above is a clinical trial exclusion criterion. Annotated with entity spans:
[Pregnancy_considerations: Females of childbearing potential who are pregnant, breast-feeding or intend to become pregnant or are not using adequate contraceptive methods]